Clinical trial inclusion criterion:
Body weight = 140 kg

Entity relations:
- Has_value("Body weight", "= 140 kg")